Subjects with serum calcium levels equal to or greater than 10.2 mg / dl.

The above is a clinical trial exclusion criterion. Annotated with entity spans:
Subjects with [Measurement: serum calcium levels] [Value: equal to or greater than 10.2 mg / dl].